下列有關聽診、觸診與聽診器（stethoscope）使用的敘述，何者錯誤？
A. 聽診器的 diaphragm 面適合來聽高頻心雜音，bell 面則適合用來聽低頻之心音及心雜音
B. 第二心音（second heart sound）與二尖瓣及三尖瓣之關閉有關
C. 可摸到 thrill 表示有強度超過 III/VI 級的心雜音
D. 正常第二心音可略分開（splitting second sound）在吸氣時比在吐氣時明顯

正確答案：B. 第二心音（second heart sound）與二尖瓣及三尖瓣之關閉有關